下列關於縱膈腔腫塊（mediastinal mass）的敘述，何者錯誤？
A. 畸胎瘤（benign teratoma）常出現在前縱膈腔
B. 淋巴瘤（lymphoma）常出現在前、中縱膈腔
C. 支氣管囊腫（bronchogenic cyst）、心包膜囊腫（pericardial cyst）常出現在中縱膈腔
D. Morgagni's橫膈疝氣（diaphragm hernia）常出現在後縱膈腔

正確答案：D. Morgagni's橫膈疝氣（diaphragm hernia）常出現在後縱膈腔